Patients with genetic problems such as galactose intolerance, Lapp lactase deficiency or glucose-galactose malabsorption, since this study drug contains lactose

The above is a clinical trial exclusion criterion. Annotated with entity spans:
Patients with [Condition: genetic problems] such as [Condition: galactose intolerance], [Condition: Lapp lactase deficiency] or [Condition: glucose-galactose malabsorption], since this study drug contains lactose